那一種甲狀腺癌，其預後極差，大部分患者於一年內死亡？
A. 乳突癌
B. 濾泡癌
C. 髓質癌
D. 未分化型癌

正確答案：D. 未分化型癌